Señale la respuesta correcta. De entre los siguientes medios de comunicación, ¿cuál se considera de coste alto por persona expuesta?:
1. Folletos.
2. Vallas.
3. Cartas postales.
4. Radio.

Respuesta correcta: 3. Cartas postales.